Serum Aspartate Aminotransferase (AST) > triple the upper limit of the normal value range and/or

The above is a clinical trial exclusion criterion. Annotated with entity spans:
[Measurement: Serum Aspartate Aminotransferase] ([Measurement: AST]) [Value: > triple the upper limit of the normal value range] [Non-query-able: and/or]